Clinical trial exclusion criterion:
participation in another study within 6 months prior.

Annotated entities:
- Competing_trial: "participation in another study within 6 months prior."